下列何者為長期服用glucocorticoid藥物最可能造成的副作用？
A. 類紅斑性狼瘡
B. 骨質疏鬆
C. 肝臟中毒
D. 腎上腺腫瘤

正確答案：B. 骨質疏鬆